Women under lactation and/or puerperium

The above is a clinical trial exclusion criterion. Annotated with entity spans:
[Person: Women] under [Condition: lactation] and/or [Condition: puerperium]